Predicted adult height (based on bone age) more than 10 cm below target height (mid parental height)

The above is a clinical trial inclusion criterion. Annotated with entity spans:
[Measurement: Predicted adult height] (based on [Qualifier: bone age]) [Value: more than 10 cm below target height] ([Qualifier: mid parental height])